Paciente de 50 años que presenta un derrame pleural con las siguientes características: aspecto pajizo, pH 7.3, cociente de proteínas pleura/suero 0.8, cociente de LDH pleura/suero 0.9, Gram y Ziehl negativos, lípidos totales, colesterol y triglicéridos normales, células mesoteliales <5%, intensa linfocitosis sin atipias, ADA 64 U/l. ¿Qué diagnóstico le sugiere?
1. Empiema pleural.
2. Derrame pleural por insuficiencia cardiaca (trasudado).
3. Mesotelioma pleural.
4. Derrame pleural tuberculoso.
5. Derrame secundario a infarto pulmonar.

Respuesta correcta: 4. Derrame pleural tuberculoso.